En el afrontamiento del dolor y de situaciones de estrés:
1. Tanto el apoyo social como el sentimiento de control sobre la propia vida son factores que contribuyen positivamente.
2. El apoyo social es un factor importante para el buen manejo de estas situaciones, pero el sentimiento de control personal de la propia vida no influye significativamente.
3. El sentimiento de control personal de la propia vida es un factor importante para el buen manejo de estas situaciones pero el apoyo social no influye significativamente.
4. Ni el sentimiento de control sobre la propia vida, ni el apoyo social, son factores que influyan positivamente.

Respuesta correcta: 1. Tanto el apoyo social como el sentimiento de control sobre la propia vida son factores que contribuyen positivamente.